In which phase of clinical trials was sutezolid in 2018?

By 2018 sutezolid had been evaluated in phase II clinical trials.